Clinical trial inclusion criterion:
Smoke on = 25 days of the past 30 days

Annotated entities:
- Observation: "Smoke"
- Multiplier: "= 25 days of the past 30 days"